Cushing's disease is associated with a tumor in what part of the body?

Cushing's disease (CD) is a rare endocrine disorder associated with increased serum levels of cortisol secreted due to an underlying tumour in pituitary.